3. Received donor lymphocyte infusion in last 28 days

The above is a clinical trial exclusion criterion. Annotated with entity spans:
[Parsing_Error: 3.] Received [Procedure: donor lymphocyte infusion] [Temporal: in last 28 days]